Complex or altered abdominal wall anatomy

The above is a clinical trial exclusion criterion. Annotated with entity spans:
[Condition: Complex] or [Condition: altered abdominal wall anatomy]